Withdrawn from statins because of perceived side effects

The above is a clinical trial inclusion criterion. Annotated with entity spans:
[Non-query-able: Withdrawn from statins because of perceived side effects]